Clinical trial exclusion criterion:
Dietary restrictions that would prohibit the consumption of standardized meals

Entity relations:
- Has_qualifier("Dietary restrictions", "would prohibit the consumption of standardized meals")